older than 18 years (of both sexes)

The above is a clinical trial inclusion criterion. Annotated with entity spans:
[Value: older than 18] [Person: years] (of [Person: both sexes])